Ranson計分法是判定急性胰臟炎嚴重度很好的方法，最初48小時非用以計分之項目為：
A. 住院後血比容（hematocrit）
B. 動脈血氧氣濃度
C. 血清鉀
D. 血清鈣

正確答案：C. 血清鉀